3. Consent to participation in the study.

The above is a clinical trial inclusion criterion. Annotated with entity spans:
[Parsing_Error: 3.] [Non-query-able: Consent to participation in the study.]